Clinical trial inclusion criterion:
fibrin-specific fibrinolytic therapy less than 24 h before randomization, non-fibrin-specific fibrinolytic therapy less than 48 h before randomization

Annotated entities:
- Procedure: "fibrinolytic therapy"
- Qualifier: "fibrin-specific"
- Temporal: "less than 24 h before randomization"
- Procedure: "fibrinolytic therapy"
- Qualifier: "non-fibrin-specific"
- Temporal: "less than 48 h before randomization"
- Reference_point: "randomization"
- Reference_point: "randomization"